Affected by systemic diseases recognized to severely affect bone metabolism (e.g. Cushing's syndrome, Addison's disease, diabetes mellitus type 1, leukaemia, pernicious anaemia, malabsorption syndromes, chronic liver disease, rheumatoid arthritis).

The above is a clinical trial exclusion criterion. Annotated with entity spans:
Affected by systemic diseases recognized to severely affect bone metabolism (e.g. [Condition: Cushing's syndrome], [Condition: Addison's disease], [Condition: diabetes mellitus type 1], [Condition: leukaemia], [Condition: pernicious anaemia], [Condition: malabsorption syndromes], [Condition: chronic liver disease], [Condition: rheumatoid arthritis]).